Clinical trial inclusion criterion:
Completed "ALO-IIT-012(PEAK study)", without major protocol deviations.

Annotated entities:
- Post-eligibility: "Completed "ALO-IIT-012(PEAK study)", without major protocol deviations"